Clinical trial exclusion criterion:
Current systemic steroid use

Entity relations:
- Has_temporal("systemic steroid use", "Current")
- Has_qualifier("steroid", "systemic")
- multi("systemic steroid use", "steroid")